1. Use of any tobacco products.

The above is a clinical trial exclusion criterion. Annotated with entity spans:
[Parsing_Error: 1.] Use of any [Drug: tobacco products].